一位 51 歲婦女因兩手近端指間關節多處腫痛一年而求診，病人感覺兩手腫痛在剛睡醒時最嚴重，可持續三小時；關節腫痛有時也會出現在兩側手腕及手肘，下列檢查最有助於診斷此病的是那一項？
A. 免疫球蛋白
B. 雙手 X 光攝影（X-ray）
C. 血中補體濃度
D. 紅血球沉降速度（ESR）

正確答案：B. 雙手 X 光攝影（X-ray）